Clinical trial exclusion criterion:
Hypersensitivity to the active substance, to FCM or any of its excipients

Entity relations:
- AND("Hypersensitivity", "active substance")
- OR("active substance", "excipients", "FCM")